What is the relationship of fyn kinase and tau?

The Fyn kinase interacts with tau. The activated Fyn kinase hyperphosphorylates the tau protein.